Clinical trial exclusion criterion:
Use of home oxygen

Annotated entities:
- Procedure: "home oxygen"